Clinical trial exclusion criteria:
Inability to give informed consent
Possible pregnancy (confirmed by urine test)
Women who are breastfeeding
Severe claustrophobia
Inability to lie flat for 20-30 minutes (the anticipated amount of time to complete the MRI procedure)
Individuals with cochlear implants
Individuals with non-MRI compatible aneurysm clips
Potential contraindications to regadenoson use due to:
Contraindication to administration of Gadolinium (Gd) based contrast agents (GBCA):

Annotated entities:
- Informed_consent: "Inability to give informed consent"
- Condition: "pregnancy"
- Mood: "Possible"
- Procedure: "urine test"
- Value: "confirmed"
- Person: "Women"
- Observation: "breastfeeding"
- Qualifier: "Severe"
- Condition: "claustrophobia"
- Condition: "Inability to lie flat"
- Qualifier: "20-30 minutes"
- Qualifier: "amount of time to complete the MRI procedure"
- Device: "cochlear implants"
- Device: "aneurysm clips"
- Qualifier: "MRI compatible"
- Negation: "non"
- Non-representable: "Potential contraindications to regadenoson use due to:"
- Drug: "Gadolinium (Gd) based contrast agents (GBCA)"
- Condition: "Contraindication"